¿Cuál o cuáles de las siguientes vías de administración se utilizan habitualmente para los fármacos de naturaleza péptidos y proteínas?:
1. Oral.
2. Intravenosa, intramuscular y subcutánea.
3. Oral, intravenosa y subcutánea.
4. Oral, intranasal e inhalatoria.
5. Oral, intramuscular e intranasal.

Respuesta correcta: 2. Intravenosa, intramuscular y subcutánea.